一位 67 歲女性病人，抽菸一天一包 30 年，戒菸 10 年，有過敏性鼻炎病史 40 年。主訴慢性咳嗽、痰少、運動性呼吸困難達 10 年。肺功能檢查：FVC=70%，FEV1=42%，FEV1/FVC=47%，TLC=109%， RV=133%，RV/TLC=61%，post-bronchodilator FEV1 improvement 9%，下列那一個診斷最適合此病人？
A. 氣喘症（asthma）
B. 慢性阻塞性肺病（COPD）
C. 心臟衰竭（heart failure）
D. 支氣管擴張症（bronchiectasis）

正確答案：B. 慢性阻塞性肺病（COPD）